Creatinine <2.0 mg/dL, or creatinine clearance >40 mL/min (as calculated by the Cockcroft-Gault method.

The above is a clinical trial inclusion criterion. Annotated with entity spans:
[Measurement: Creatinine] [Value: <2.0 mg/dL], or [Measurement: creatinine clearance] [Value: >40 mL/min] (as calculated by the [Qualifier: Cockcroft-Gault method].